Significant anemia (Hb < 90 g/l)

The above is a clinical trial exclusion criterion. Annotated with entity spans:
[Qualifier: Significant] [Condition: anemia] ([Measurement: Hb] [Value: < 90 g/l])